肺炎披衣菌（Chlamydia pneumoniae）與下列何種病變密切相關？
A. 子宮頸癌（cervical cancer）
B. 十二指腸潰瘍（duodenal ulcer）
C. 軟性下疳（chancre）
D. 動脈粥樣硬化（atherosclerosis）

正確答案：D. 動脈粥樣硬化（atherosclerosis）